Clinical trial inclusion criterion:
6. Documented stable angina pectoris [Canadian Cardiovascular Society Classification (CCS) 1, 2, 3, or 4], unstable angina pectoris with documented ischemia (Braunwald Class IB-C, IIB-C, or IIIB-C), non-ST segment elevation myocardial infarction, or documented silent ischemia.

Entity relations:
- Has_value("Canadian Cardiovascular Society Classification (CCS)", "1, 2, 3, or 4")
- Has_qualifier("stable angina pectoris", "stable")
- Subsumes("stable", "Canadian Cardiovascular Society Classification (CCS)")
- Has_qualifier("unstable angina pectoris", "unstable")
- Has_value("Braunwald Class", "IB-C, IIB-C, or IIIB-C")
- Has_qualifier("silent ischemia", "silent")
- Has_context("silent ischemia", "documented")
- Has_context("ischemia", "documented")
- Subsumes("ischemia", "Braunwald Class")
- AND("unstable angina pectoris", "ischemia")
- OR("stable angina pectoris", "non-ST segment elevation myocardial infarction", "silent ischemia", "unstable angina pectoris")